Clinical trial exclusion criterion:
Participation in another investigational trial within 90 days

Annotated entities:
- Non-query-able: "Participation in another investigational trial within 90 days"